Clinical trial inclusion criterion:
Renal function: serum creatinine is 44-133 mmol/L;

Entity relations:
- Has_value("serum creatinine", "44-133 mmol/L")